張先生被家屬送來急診室，他們只知道張先生因心情不好，吞了一大把頭痛藥（acetaminophen）後就一直噁心、嘔吐、全身 倦怠無力。抽血檢查結果如下：alanine aminotransferase（ALT）：894 U/L（normal：0～40）；aspartate aminotransferase
 （AST）：720 U/L（normal：5～45）；total bilirubin：2.2 mg/dL（normal：0.2～1.6）；direct bilirubin：1.8 mg/dL
 （normal：0～0.3）；alkaline phosphatase（ALK-P）：42 U/L（normal：10～100）；gamma-glutamyl transpeptidase（γ-
 U/L（normal：6～60）。關於此藥物引起之傷害，何者最不正確？
A. 這是一種與劑量（dose dependent）有關的肝傷害
B. 血中藥物濃度與肝傷害嚴重度相關
C. 張先生如未發生肝衰竭，日後還是會演變成慢性肝病
D. 可能引起腎衰竭

正確答案：C. 張先生如未發生肝衰竭，日後還是會演變成慢性肝病